下列何種藥物最適合治療肺炎黴漿菌（Mycoplasma pneumoniae）所引起之肺炎？
A. 青黴素（Penicillin）
B. 碳青黴烯（Carbapenem）
C. 頭孢子素（Cephalosporin）
D. 紅黴素（Erythromycin）

正確答案：D. 紅黴素（Erythromycin）